一位 25 歲男性表現 nephrotic syndrome。腎小球病理變化以陷塌型局部區段硬化（collapsing focal segmental glomerulosclerosis）為主，腎小球內皮細胞可見多量 tubuloreticular inclusions，腎小管常見局部囊狀擴大（cystic dilation）。此病人最可能感染：
A. cytomegalovirus（CMV）
B. hepatitis B virus（HBV）
C. human immunodeficiency virus（HIV）
D. human papilloma virus（HPV）

正確答案：C. human immunodeficiency virus（HIV）